Clinical trial exclusion criterion:
(3) If you have sexual intercourse with only one male partner who has been confirmed to have no semen after fertilization.

Annotated entities:
- Pregnancy_considerations: "If you have sexual intercourse with only one male partner who has been confirmed to have no semen after fertilization."